Clinical trial exclusion criterion:
Chronic obstructive pulmonary disease

Annotated entities:
- Condition: "Chronic obstructive pulmonary disease"